有關扁桃腺周圍膿瘍（peritonsillar abscess）的敘述，下列何者錯誤？
A. 是頭頸部深部感染最常見的疾病之一
B. 有使用抗生素治療的病人，仍會發生扁桃腺周圍膿瘍
C. 可以利用針吸（needle aspiration）進行引流治療
D. 緊急扁桃腺切除術，是經常採用的治療方式

正確答案：D. 緊急扁桃腺切除術，是經常採用的治療方式